Clinical trial exclusion criterion:
no female subject of childbearing potential without use of effective nonhormonal birth control methods, or not willing to continue practicing these birth control methods for at least 30 days after the end of the treatment period

Entity relations:
- Has_qualifier("nonhormonal birth control", "effective")
- Has_index("for at least 30 days after the end of the treatment period", "the end of the treatment period")
- Has_temporal("birth control methods", "for at least 30 days after the end of the treatment period")
- Has_mood("birth control methods", "willing to continue practicing")
- Has_negation("willing to continue practicing", "not")
- Has_negation("nonhormonal birth control", "without")
- OR("nonhormonal birth control", "birth control methods")